一位 65 歲婦女，主訴臉色蒼白及疲倦。過去除了有高血壓的病史外，無其他全身性疾患。血液檢查顯示血紅素為 10.1 g/dL，RBC 3.86×106/mm3，MCV 77.1 fL，白血球 6,610/mm3，分類正常，血小板 455,000/mm3，血清鐵 25μg/dL，全鐵結合能力（TIBC）447μg/dL，血鐵質（ferritin）3 ng/mL，肝、腎功能正常。為了要找出造成這位婦女貧血的原因，以下各項檢查，何種是目前最需要做的？
A. C-reactive protein
B. Erythrocyte sedimentation rate
C. Stool occult blood
D. Bone marrow examination

正確答案：C. Stool occult blood